Clinical trial exclusion criterion:
High myopia in the study eye, with a spherical equivalent of >8.00D at screening

Entity relations:
- Has_qualifier("High myopia", "in the study eye")
- Has_value("spherical equivalent", ">8.00D")
- AND("High myopia", "spherical equivalent")
- Has_temporal("High myopia", "at screening")